7. Active, suspected or prior documented autoimmune disease (including inflammatory bowel disease, celiac disease, Wegner's granulomatosis, active Hashimoto's thyroiditis, rheumatoid arthritis, lupus, scleroderma and its variants, multiple sclerosis, myasthenia gravis). Vitiligo, type I diabetes mellitus, residual hypothyroidism due to autoimmune condition only requiring hormone replacement, psoriasis not requiring systemic treatment, or conditions not expected to recur in the absence of an external trigger are permitted.

The above is a clinical trial exclusion criterion. Annotated with entity spans:
[Parsing_Error: 7.] Active, suspected or prior documented [Condition: autoimmune disease] (including [Condition: inflammatory bowel disease], [Condition: celiac disease], [Condition: Wegner's granulomatosis], active [Condition: Hashimoto's thyroiditis], [Condition: rheumatoid arthritis], [Condition: lupus], [Condition: scleroderma] and its variants, [Condition: multiple sclerosis], [Condition: myasthenia gravis]). [Condition: Vitiligo], [Condition: type I diabetes mellitus], [Condition: residual hypothyroidism] [Qualifier: due to autoimmune condition] only [Qualifier: requiring hormone replacement], [Condition: psoriasis] [Negation: not] [Qualifier: requiring systemic treatment], or [Condition: conditions] [Qualifier: not expected to recur] in the absence of an external trigger are permitted.